下列何者具有肌間盤（intercalated disc）？
A. 心肌
B. 骨骼肌
C. 豎毛肌
D. 平滑肌

正確答案：A. 心肌